Clinical trial exclusion criterion:
pregnancy or lactation

Annotated entities:
- Pregnancy_considerations: "pregnancy or lactation"